Clinical trial exclusion criterion:
Maternal history of placental abruptio

Entity relations:
- AND("Maternal history of", "placental abruptio")